醫護人員二人操作成人 CPR，壓胸與吹氣比是多少？
A. 15：2
B. 5：1
C. 30：2
D. 15：1

正確答案：C. 30：2